Clinical trial exclusion criterion:
Active bleeding or at high risk of bleeding

Entity relations:
- Has_qualifier("bleeding", "at high risk")
- Has_qualifier("bleeding", "Active")
- OR("bleeding", "bleeding")